Clinical trial inclusion criterion:
Age>18 years

Annotated entities:
- Person: "Age"
- Value: ">18 years"